Clinical trial exclusion criterion:
Preoperative neurological deficits

Annotated entities:
- Condition: "neurological deficits"
- Qualifier: "Preoperative"